下列何者是氟化物（fluoride）慢性中毒之症狀？
A. 高鈣血症
B. 高血糖
C. 高血壓
D. 骨硬化（osteosclerosis）

正確答案：D. 骨硬化（osteosclerosis）